Clinical trial exclusion criterion:
uncontrolled intercurrent illness

Annotated entities:
- Qualifier: "uncontrolled"
- Condition: "intercurrent illness"